Scheduled back surgery

The above is a clinical trial inclusion criterion. Annotated with entity spans:
[Mood: Scheduled] [Procedure: back surgery]